Clinical trial inclusion criterion:
Postnatal age 2 to 48 hours;

Entity relations:
- Has_value("Postnatal age", "2 to 48 hours")